Clinical trial exclusion criterion:
specific brain related disorder (such as tuberous sclerosis)

Annotated entities:
- Condition: "disorder"
- Qualifier: "brain"
- Condition: "tuberous sclerosis"